罹患透納氏徵候群（Turner syndrome）的 5 歲女童，很少出現下列那一項特徵？
A. 身材矮小
B. 主動脈縮窄
C. 腎臟畸型（renal malformation）
D. 生長激素分泌明顯不足

正確答案：D. 生長激素分泌明顯不足